Clinical trial inclusion criterion:
Open, video-assisted thoracoscopic or robotic surgeries

Entity relations:
- Has_qualifier("thoracoscopic surgeries", "video-assisted")
- OR("thoracoscopic surgeries", "robotic surgeries")